What is caused by a gain-of-function mutation in CLCN2?

Primary aldosteronism is an autosomal dominant disorder caused by gain-of-function mutations in CLCN2.